don't have Diabetes and abnormal metabolism of sugar

The above is a clinical trial exclusion criterion. Annotated with entity spans:
[Negation: don't have] [Condition: Diabetes] and [Condition: abnormal metabolism of sugar]